Clinical trial inclusion criterion:
Smoke at least 10 cigarettes daily

Annotated entities:
- Observation: "Smoke"
- Value: "at least 10 cigarettes daily"